Clinical trial exclusion criterion:
DSM-IV diagnosis of Alcohol or Substance Abuse within the last one month (except nicotine) or DSM-5 diagnosis of Substance Use Disorder in the last six months (except nicotine)

Annotated entities:
- Qualifier: "DSM-IV"
- Condition: "Alcohol Abuse"
- Condition: "Substance Abuse"
- Temporal: "within the last one month"
- Drug: "nicotine"
- Negation: "except"
- Qualifier: "DSM-5"
- Condition: "Substance Use Disorder"
- Temporal: "in the last six months"
- Drug: "nicotine"
- Negation: "except"